Clinical trial exclusion criterion:
Age less than 10 years or greater than 55 years, at time of consent

Entity relations:
- Has_value("Age", "less than 10 years")
- Has_temporal("Age", "at time of consent")
- multi("consent", "consent")
- Has_index("at time of consent", "consent")
- OR("less than 10 years", "greater than 55 years")